Absence of any sign of dementia/cognitive impairment in neuropsychological examinationsPatients for brain imaging:

The above is a clinical trial inclusion criterion. Annotated with entity spans:
[Negation: Absence of] any [Condition: sign of dementia]/[Condition: cognitive impairment] in [Procedure: neuropsychological examinations][Parsing_Error: Patients for brain imaging:]